Clinical trial inclusion criterion:
5. Patients with carpal tunnel syndrome must have had a diagnosis by combination clinical neurological examination (e.g., Phalen's and Tinel's signs), electrodiagnostic testing, and daily painful symptoms of at least 3 months' duration

Annotated entities:
- Condition: "carpal tunnel syndrome"
- Procedure: "clinical neurological examination"
- Condition: "Phalen's signs"
- Condition: "Tinel's signs"
- Procedure: "electrodiagnostic"
- Multiplier: "daily"
- Temporal: "at least 3 months' duration"
- Condition: "painful symptoms"